Current unstable medical condition (e.g. unstable angina, myocardial infarction or coronary revascularization in the preceding 12 months, cardiac failure, chronic renal failure, chronic hepatic disease, severe pulmonary disease, blood disorders, poorly controlled diabetes, chronic infection)

The above is a clinical trial exclusion criterion. Annotated with entity spans:
[Temporal: Current] [Condition: unstable medical condition] (e.g. [Condition: unstable angina], [Condition: myocardial infarction] or [Procedure: coronary revascularization] [Temporal: in the preceding 12 months], [Condition: cardiac failure], [Condition: chronic renal failure], [Condition: chronic hepatic disease], [Qualifier: severe] [Condition: pulmonary disease], [Condition: blood disorders], [Negation: poorly] [Qualifier: controlled] [Condition: diabetes], [Condition: chronic infection])